有關蜘蛛痣（spider angioma）的敘述，下列何者錯誤？
A. 可發生於急性肝病
B. 可發生於懷孕婦女
C. 是一種小靜脈
D. 常見於上半身

正確答案：C. 是一種小靜脈